Clinical trial inclusion criterion:
Patients' CMV-DNA = 1000cp/ml in treatment group and being negative in prophylactic group.

Entity relations:
- Has_value("prophylactic group", "negative")
- Has_value("treatment group", "= 1000cp/ml")
- AND("CMV-DNA", "treatment group")
- OR("treatment group", "prophylactic group")